Clinical trial exclusion criterion:
Recently suffered from MI or CVA.

Entity relations:
- Has_temporal("MI", "Recently")
- OR("MI", "CVA")